La histidina se caracteriza por:
1. Presentar en su estructura un grupo indol.
2. Presentar un único N en su estructura.
3. Una cadena lateral de carácter aromático.
4. Una cadena lateral que puede tomar o ceder protones a pH fisiológico.
5. Ser una proteína implicada en la inflamación.

Respuesta correcta: 4. Una cadena lateral que puede tomar o ceder protones a pH fisiológico.